Clinical trial exclusion criterion:
lack of ability to use the study devices

Annotated entities:
- Negation: "lack of"
- Observation: "ability to use the study devices"
- Device: "study devices"